Which TREX mRNA export complex subunits have been implicated in neurodevelopmental disorders?

THOC1, THOC2 and THOC5 have been implicated in neurodegeneration and cancer. THOC6, THO7 and THO8 have also been implicated.